Clinical trial exclusion criterion:
Carbamazepine, phenytoin, phenobarbital, oxcarbazepine

Entity relations:
- OR("Carbamazepine", "phenytoin", "phenobarbital", "oxcarbazepine")